Clinical trial exclusion criterion:
Pregnant or lactating female.

Entity relations:
- OR("Pregnant", "lactating")